Clinical trial inclusion criterion:
No prior surgical treatment in the sites planned for therapy

Annotated entities:
- Procedure: "surgical treatment"
- Negation: "No"
- Non-query-able: "No prior surgical treatment in the sites planned for therapy"